Patients scheduled for elective intervention to treat ischemic cardiovascular disease

The above is a clinical trial inclusion criterion. Annotated with entity spans:
[Post-eligibility: Patients scheduled for elective intervention to treat ischemic cardiovascular disease]